下列關於譫妄（delirium）的敘述，何者錯誤？
A. 通常是突然發作（acute onset）且症狀時好時壞（fluctuating）
B. 個案的認知功能常常會有變化
C. 個案的意識狀態常常不甚清醒
D. 譫妄通常是精神病發作的前兆，與身體疾病無關係

正確答案：D. 譫妄通常是精神病發作的前兆，與身體疾病無關係